Para que una tracción esquelética sea eficaz, los principios que debe cumplir son:
1. Contratracción, continuidad y alineación corporal.
2. Alineación corporal y movilidad articular.
3. Movilidad articular y continuidad.
4. Contratracción y alineación corporal.
5. Continuidad, alineación corporal y movilidad articular.

Respuesta correcta: 1. Contratracción, continuidad y alineación corporal.